Clinical trial inclusion criterion:
Healthy obese male and female volunteers aged 18 to 55 years, inclusive. Heterozygous subjects may be 18 to 65 years inclusive.

Annotated entities:
- Condition: "obese"
- Condition: "Healthy"
- Person: "male"
- Person: "female"
- Grammar_Error: "and"
- Person: "aged"
- Value: "18 to 55 years, inclusive"
- Condition: "Heterozygous"
- Context_Error: "Heterozygous"
- Value: "18 to 65 years inclusive"
- Parsing_Error: "Heterozygous subjects may be 18 to 65 years inclusive."